Which biological drugs are EMA approved for pediatric psoriasis?

Currently there are three European Medicines Agency (EMA)-approved biological treatment options for pediatric psoriasis: etanercept, ustekinumab, and adalimumab.